睪丸畸胎瘤（teratoma）病童，如果血中腫瘤標誌胎兒蛋白（α-fetoprotein）升高時，此腫瘤可能含有那種惡性成分？
A. 卵黃囊瘤（yolk sac tumor）
B. 肝細胞癌 (hepatocellular carcinoma )
C. 消化道腺癌（adenocarcinoma）
D. 神經母細胞瘤（neuroblastoma）

正確答案：A. 卵黃囊瘤（yolk sac tumor）